Patients with hyperkalemia (over 5.5 meq / L)

The above is a clinical trial exclusion criterion. Annotated with entity spans:
Patients with [Condition: hyperkalemia] ([Value: over 5.5 meq / L])